Clinical trial inclusion criterion:
On standard immunosuppression with tacrolimus and prednisone

Entity relations:
- AND("standard immunosuppression", "tacrolimus")
- OR("tacrolimus", "prednison")